Clinical trial inclusion criterion:
Target ulcer area between 0.5 and 5 sqcm, and more than 4 weeks old.

Entity relations:
- Has_value("Target ulcer area", "between 0.5 and 5 sqcm")
- Has_temporal("Target ulcer area", "more than 4 weeks old")